Where is the agouti-related peptide expressed?

The agouti-related peptide is expressed in neurons in the hypothalamus.